Clinical trial exclusion criterion:
Any condition that in the opinion of the investigator or the Novartis medical monitor would jeopardize the evaluation of efficacy or safety

Entity relations:
- Has_qualifier("condition", "that would jeopardize the evaluation of efficacy")
- OR("that would jeopardize the evaluation of efficacy", "that would jeopardize safety")
- OR("in the opinion of the investigator", "in the opinion of the Novartis medical monitor")